What is the indication for valbenazine?

Valbenazine granted breakthrough drug status for treating tardive dyskinesia.